Clinical trial exclusion criterion:
Hepatic Impairment

Annotated entities:
- Condition: "Hepatic Impairment"